一位 13 歲的男童這 2 週來有上眼皮浮腫、下肢水腫現象，體重增加 5 公斤。男童過往無類似病史。尿液常規檢查發現 Protein >300 mg/dL; WBC 0-2/HPF; RBC 0-2/HPF。血中的血清白蛋白值為 0.9 g/dL。 下列相關處置或敘述，何者錯誤？
A. 不需先作切片診斷，可直接使用類固醇治療，治療無效再作腎切片
B. 連續使用 6 週之每日類固醇治療比連續使用 4 週之每日類固醇治療的疾病復發率低
C. 利尿劑有可能會增加血栓併發症（thromboemboli complication）的可能性
D. 對類固醇倚賴（steroid dependent）是指在類固醇改隔日劑量時或停用 28 日內復發

正確答案：A. 不需先作切片診斷，可直接使用類固醇治療，治療無效再作腎切片